Clinical trial exclusion criterion:
BMI >37

Annotated entities:
- Measurement: "BMI"
- Value: ">37"